Clinical trial exclusion criterion:
Previous participation in this study

Entity relations:
- Has_temporal("participation in this study", "Previous")